Electroconvulsive therapy in last 6 months

The above is a clinical trial exclusion criterion. Annotated with entity spans:
[Procedure: Electroconvulsive therapy] [Temporal: in last 6 months]